Clinical trial exclusion criterion:
History of developmental disorder or IQ score < 70

Annotated entities:
- Condition: "developmental disorder"
- Measurement: "IQ score"
- Value: "< 70"